Clinical trial exclusion criterion:
weight <50kg or BMI =35 kg/m2

Entity relations:
- Has_value("BMI", "=35 kg/m2")
- Has_value("weight", "<50kg")
- OR("weight", "BMI")